Clinical trial exclusion criterion:
10. Pregnant or breast feeding

Entity relations:
- OR("Pregnant", "breast feeding")